Diagnosis of moderate to severe Ankylosing Spondylitis (AS) with prior documented radiologic evidence fulfilling the Modified New York criteria for AS

The above is a clinical trial inclusion criterion. Annotated with entity spans:
Diagnosis of [Qualifier: moderate] to [Qualifier: severe] [Condition: Ankylosing Spondylitis (AS)] with [Temporal: prior] documented [Condition: radiologic evidence] [Value: fulfilling] the [Measurement: Modified New York criteria for AS]